What is caused by biallelic variants in SPATA5L1?

Bi-allelic variants in SPATA5L1 lead to microcephaly, intellectual disability, spastic-dystonic cerebral palsy, epilepsy, and hearing loss.